Comparando el comportamiento redox de los sistemas de plata y sodio:
1. Na+ es un buen oxidante, por tener su sistema un alto potencial de reducción.
2. Ag es un excelente oxidante, por lo que no se oxida al aire.
3. Ag+ es un buen oxidante, y por tanto fácilmente reducible al metal.
4. Los dos metales se disuelven en medio ácido liberando H2
5. Los dos metales dismutan espontáneamente en agua.

Respuesta correcta: 3. Ag+ es un buen oxidante, y por tanto fácilmente reducible al metal.